脾臟中，下列何者具有中央動脈（central artery）？
A. 動脈周圍淋巴鞘（periarterial lymphatic sheath）
B. 紅髓（red pulp）
C. 皮質
D. 脾索（splenic cord）

正確答案：A. 動脈周圍淋巴鞘（periarterial lymphatic sheath）